Clinical trial exclusion criterion:
Repeated episodes of severe hypoglycaemia within the last six months prior to Screening

Entity relations:
- Has_index("within the last six months prior to Screening", "Screening")
- Has_temporal("severe hypoglycaemia", "within the last six months prior to Screening")
- Has_multiplier("severe hypoglycaemia", "Repeated")